Surgically altered biliary tract anatomy, not including prior cholecystectomy

The above is a clinical trial exclusion criterion. Annotated with entity spans:
[Condition: Surgically altered biliary tract anatomy], [Negation: not] including [Temporal: prior] [Procedure: cholecystectomy]